7. Informed consent obtained and signed

The above is a clinical trial inclusion criterion. Annotated with entity spans:
7. [Post-eligibility: Informed consent obtained and signed]